臨床上希望利用兒童年齡推估頭圍大小，透過 2～5 歲兒童樣本的分析得到迴歸方程式為 Y=4+0.75X，Y 為頭圍長度（以公分為單位），X 為兒童年齡（以月為單位），判定係數為 0.70，下列描述何者錯誤？
A. 該迴歸方程式假設兒童月齡與頭圍呈直線關係
B. 3 歲的兒童，其頭圍平均值應為 31 公分
C. 每增加 1 歲，頭圍平均增加 0.75 公分
D. 這條迴歸方程式可以解釋兒童樣本中頭圍變異量的 70%

正確答案：C. 每增加 1 歲，頭圍平均增加 0.75 公分